Clinical trial exclusion criterion:
Severe physical or psychological concomitant diseases that might impair compliance with the provisions of the study protocol or that might impair the assessment of drug or patient safety, e.g. clinically significant ascites, cardiac failure, NYHA III or IV, clinically relevant pathologic findings in ECG

Entity relations:
- Has_value("NYHA", "III or IV")
- Has_context("ECG", "pathologic findings")
- Has_qualifier("ECG", "clinically relevant")
- AND("cardiac failure", "NYHA")
- Has_qualifier("ascites", "clinically significant")
- Subsumes("physical diseases", "ascites")
- OR("physical diseases", "psychological diseases")
- OR("ascites", "cardiac failure", "ECG")